若一病患因腸胃或腎臟疾病流失 3L 之 half-isotonic NaCl，對 intracellular fluid（ICF）及 extracellular fluid（ECF）volume 之影響為何？
A. ICF volume loss：1.5 L；ECF volume loss：1.5 L
B. ICF volume loss：2.0 L；ECF volume loss：1.0 L
C. ICF volume loss：1.0 L；ECF volume loss：2.0 L
D. ICF volume loss：0.5 L；ECF volume loss：2.5 L

正確答案：C. ICF volume loss：1.0 L；ECF volume loss：2.0 L